Clinical trial exclusion criterion:
being treated with a beta-blocker

Entity relations:
- AND("treated", "beta-blocker")